Which human tissue synthesize CRP?

CRP is predominantly produced in the liver in a native pentameric form (nCRP).